¿Cuál es la respuesta correcta acerca de los factores orgánicos en el retraso mental?:
1. Son especialmente importantes en los niveles más graves de retraso.
2. No se consideran como tales aquellos que actúan después del nacimiento.
3. Su influencia se demuestra por la distribución normal del Cociente Intelectual en la población.
4. Cuando son hereditarios, implican siempre genes múltiples.

Respuesta correcta: 1. Son especialmente importantes en los niveles más graves de retraso.